68 歲男性，送來急診時主訴腹部劇痛直達後背，病人身高 170 公分，體重 90 公斤，理學檢查血壓 mmHg，腹部有一搏動性腫塊，請問此病形成原因最可能為何？
A. 糖尿病（DM）
B. 動脈粥狀硬化（atherosclerosis）
C. 血管彈性組織退化（elastic tissue degeneration）
D. 血管炎（vasculitis）

正確答案：B. 動脈粥狀硬化（atherosclerosis）